藥品之處方，醫師如未註明不可替代，藥師（藥劑生）得以相同價格或低於原處方藥品價格之同成分、同劑型、同劑量其他廠牌藥品替代之規定，出自：
A. 全民健康保險醫療辦法
B. 全民健康保險法
C. 全民健康保險特約藥局特約要點
D. 藥師法

正確答案：A. 全民健康保險醫療辦法